某人步行途中，遭機車搶劫，幸而身體與頭部均無受傷害，意識始終清楚，但面對警察製作筆錄以及隨後的一週，均仍完全無法描述搶劫前後的情景，包括：車輛顏色、車號、地點與事發過程。此現象為：
A. 創傷後壓力症候群（posttraumatic stress disorder）
B. 適應障礙（adjustment disorder）
C. 解離性失憶（dissociative amnesia）
D. 轉化（conversion）

正確答案：C. 解離性失憶（dissociative amnesia）